Una mujer de 58 años acude a la consulta por disnea de medianos esfuerzos, debilidad muscular en extremidades superiores y disfagia a sólidos de tres meses de evolución. A la exploración física se objetiva pérdida de fuerza en extremidades superiores con sensibilidad conservada. La auscultación pulmonar muestra hipofonesis generalizada. Se realiza una radiografía de tórax en la que se aprecian unos pulmones poco inspirados y atelectasias laminares en las bases pulmonares. La gasometría muestra pH 7.39, PCO2 48 mmHg, PO2 63 mmHg, HCO3 28 mmol/L, SatO2 93%. La combinación de mecanismos fisiológicos que mejor explican esta gasometría es:
1. Disminución de la FiO2 (fracción inspirada de oxígeno) y alteración de la difusión.
2. Alteración de la difusión y trastorno de la relación ventilación/perfusión.
3. Hipoventilación alveolar y disminución de la FiO2.
4. Trastorno de la relación ventilación/perfusión e hipoventilación alveolar.
5. Aumento de la presión de la arteria pulmonar y disminución de la difusión.

Respuesta correcta: 4. Trastorno de la relación ventilación/perfusión e hipoventilación alveolar.